使用毛地黃（digoxin）藥物時，下列何者較少會加重毛地黃的毒性？
A. 高血鈣（hypercalcemia）
B. 高血鉀（hyperkalemia）
C. 心肌炎
D. 腎功能差

正確答案：B. 高血鉀（hyperkalemia）